在腹部超音波檢查時看到 pseudokidney sign，可能是下列何種病變？
A. 腸扭轉（volvulus）
B. 急性膽囊炎（acute cholecystitis）
C. 腸套疊（intussusception）
D. 腎胚母肉瘤（Wilms' tumor）

正確答案：C. 腸套疊（intussusception）